cognitive impairment (< 120 points on the Mattis Dementia Rating Scale)

The above is a clinical trial exclusion criterion. Annotated with entity spans:
[Condition: cognitive impairment] ([Value: < 120 points] on the [Measurement: Mattis Dementia Rating Scale])